Clinical trial exclusion criteria:
Subjects with a history of hypercoagulopathy, deep vein thrombosis (DVT), pulmonary embolism
Renal impairment
Subjects with known hypersensitivity to tranexamic acid
Consecutive fibrinolytic states to coagulopathy
History of convulsions

Annotated entities:
- Condition: "hypercoagulopathy"
- Condition: "deep vein thrombosis"
- Condition: "DVT"
- Condition: "pulmonary embolism"
- Temporal: "history"
- Condition: "Renal impairment"
- Condition: "hypersensitivity"
- Drug: "tranexamic acid"
- Condition: "fibrinolytic states"
- Condition: "coagulopathy"
- Temporal: "History"
- Condition: "convulsions"